WHO group II, III, IV, V PH

The above is a clinical trial exclusion criterion. Annotated with entity spans:
[Measurement: WHO] [Value: group II, III, IV, V] [Condition: PH]